En el error de Tipo II:
1. No se rechaza la hipótesis alternativa siendo cierta.
2. No se rechaza la hipótesis nula siendo falsa.
3. No se rechaza la hipótesis nula siento cierta.
4. Se rechaza la hipótesis nula siendo cierta.
5. Se acepta la hipótesis alternativa siendo falsa.

Respuesta correcta: 2. No se rechaza la hipótesis nula siendo falsa.